Clinical trial exclusion criterion:
Previous radiotherapy for the treatment of unresectable, locally advanced or metastatic breast cancer is not allowed if more than 25% of marrow-bearing bone has been irradiated or the last fraction of radiotherapy has been administered within approximately 3 weeks prior to randomization.

Entity relations:
- Has_temporal("radiotherapy", "Previous")
- Has_qualifier("breast cancer", "unresectable")
- Has_value("marrow-bearing bone irradiated", "more than 25%")
- OR("unresectable", "locally advanced", "metastatic")